Clinical trial exclusion criterion:
Has an active infection requiring systemic therapy

Annotated entities:
- Procedure: "systemic therapy"
- Temporal: "active"
- Condition: "infection"
- Qualifier: "requiring systemic therapy"